Inhibe la integrasa del VIH el (la):
1. Efavirenz.
2. Tenofovir.
3. Ritonavir.
4. Emtricitabina.
5. Raltegravir.

Respuesta correcta: 5. Raltegravir.